下列何者走在肱骨內上髁（medial epicondyle of humerus）的後方？
A. 肌皮神經（musculocutaneous nerve）
B. 正中神經（median nerve）
C. 尺神經（ulnar nerve）
D. 橈神經（radial nerve）

正確答案：C. 尺神經（ulnar nerve）